Hypotension.

The above is a clinical trial exclusion criterion. Annotated with entity spans:
[Condition: Hypotension].